Una reacción clave en la regulación de la expresión génica es la acetilación/desatecilación en las histonas de algunos de sus residuos de:
1. Serina.
2. Treonina.
3. Lisina.
4. Triptófano.
5. Alanina.

Respuesta correcta: 3. Lisina.